Multiple gated acquisition (MUGA), echocardiogram, cardiac MRI, and/or pulmonary function tests (PFT) performed and reviewed by transplant center (for individuals with an ejection fraction and diffusing capacity [DLCO] of 40-50%, the appropriate cardiology or pulmonary consultations should be considered if the individual has severe heart or lung disease at the initiation of therapy)

The above is a clinical trial inclusion criterion. Annotated with entity spans:
[Procedure: Multiple gated acquisition (MUGA)], [Procedure: echocardiogram], [Procedure: cardiac MRI], and/or [Procedure: pulmonary function tests (PFT)] performed and [Qualifier: reviewed by transplant center] (for individuals with an ejection fraction and diffusing capacity [DLCO] of 40-50%, the appropriate cardiology or pulmonary consultations should be considered if the individual has severe heart or lung disease at the initiation of therapy)